Clinical trial exclusion criterion:
If local anesthetic allergy is present

Annotated entities:
- Drug: "local anesthetic"
- Condition: "allergy"